baseline systolic blood pressure (SBP) < 100 mmHg

The above is a clinical trial exclusion criterion. Annotated with entity spans:
[Temporal: baseline] [Measurement: systolic blood pressure] ([Measurement: SBP]) [Value: < 100 mmHg]